What is the definition of General Regulatory Factors (GRFs)?

In Saccharomyces cerevisiae, a group of more than 200 co-regulated genes (Ribi genes) is involved in ribosome biogenesis. This regulon has been shown to rely on a small set of transcriptional regulators (mainly Abf1, but also Reb1, Tbf1 and Rap1) referred to as general regulatory factors (GRFs) because of their widespread binding and action at many promoters and other specialized genomic regions.